陳先生幾天前忽然出現下背疼痛與右腿麻痛伴隨著工作吃力，腰椎核磁共振掃描（MRI）出現腰椎第四、第五節間椎間盤突出。下列何種復健治療最適合？
A. 下背熱敷配合骨盆牽引治療（pelvic traction）
B. 電刺激（electric stimulation）
C. 超音波（ultrasound）
D. 水療（hydrotherapy）

正確答案：A. 下背熱敷配合骨盆牽引治療（pelvic traction）